Clinical trial exclusion criterion:
Patients with Non-androgenetic causes of hair loss.

Annotated entities:
- Condition: "Non-androgenetic causes of hair loss"